Clinical trial inclusion criterion:
Patient has demonstrated compliance, as assessed by the investigator, with the parent study protocol requirements Willingness and ability to comply with scheduled visits, treatment plans and any other study procedures

Annotated entities:
- Post-eligibility: "Patient has demonstrated compliance, as assessed by the investigator, with the parent study protocol requirements Willingness and ability to comply with scheduled visits, treatment plans and any other study procedures"